HCV RNA level at most 6 months prior to the Baseline/Day 1 visit.

The above is a clinical trial inclusion criterion. Annotated with entity spans:
[Measurement: HCV RNA level] [Temporal: at most 6 months prior to the Baseline/Day 1 visit].